Clinical trial exclusion criterion:
Pregnancy or breast-feeding

Annotated entities:
- Condition: "Pregnancy"
- Condition: "breast-feeding"